肺癌手術後，死亡原因最常見的是：
A. 肺炎併	血症（pneumonia with sepsis）
B. 心衰竭（heart failure）
C. 腎衰竭（renal failure）
D. 肝衰竭（hepatic failure）

正確答案：A. 肺炎併	血症（pneumonia with sepsis）